Known intolerance to tramadol or other contraindications for the drug

The above is a clinical trial exclusion criterion. Annotated with entity spans:
Known [Condition: intolerance] to [Drug: tramadol] or [Qualifier: other] [Condition: contraindications] for [Drug: the drug]